Clinical trial inclusion criterion:
Male or female patients at least 18 years of age.

Annotated entities:
- Person: "Male"
- Person: "female"
- Value: "at least 18 years"
- Person: "age"